Clinical trial exclusion criterion:
Prior CABG surgery

Annotated entities:
- Temporal: "Prior"
- Procedure: "CABG surgery"